What is the asosciation between the eustachian tube and the palatine muscle of the uvula?

Palatal musculature is known to be responsible for the active opening of the eustachian (auditory) tube